Clinical trial inclusion criterion:
Life expectancy should be greater than 6 months.

Annotated entities:
- Observation: "Life expectancy"
- Value: "greater than 6 months"